Clinical trial exclusion criterion:
Any fracture in the leg to be measured within 6 months prior to the screening visit.

Annotated entities:
- Condition: "fracture in the leg"
- Temporal: "within 6 months prior to the screening visit"
- Reference_point: "the screening visit"